Clinical trial inclusion criteria:
Age greater than 18
NOSE score greater than 55
Nasal septal deviation on exam

Annotated entities:
- Person: "Age"
- Value: "greater than 18"
- Measurement: "NOSE score"
- Value: "greater than 55"
- Condition: "Nasal septal deviation"